Clinical trial exclusion criterion:
Chronic kidney disease stage 5 (GFR < 15 ml/min)

Entity relations:
- Has_value("GFR", "< 15 ml/min)")
- Has_qualifier("Chronic kidney disease", "stage 5")
- Subsumes("Chronic kidney disease", "GFR")